Adequate haematological function:

The above is a clinical trial inclusion criterion. Annotated with entity spans:
[Parsing_Error: Adequate haematological function:]